下列何者是常見於發生在後期愛滋病患者，尤其是該患者CD4+的T lymphocyte數目少於 10 cells/mm3 時的分枝桿菌（Mycobacterium）感染？
A. M. leprae
B. M. avium complex
C. M. bovis
D. M. kansasii

正確答案：B. M. avium complex